Clinical trial inclusion criterion:
First or second single kidney (cadaveric or living donors) transplant recipients.

Annotated entities:
- Procedure: "transplant second single kidney"
- Procedure: "First single kidney transplant"
- Qualifier: "cadaveric donors"
- Qualifier: "living donors"